Clinical trial exclusion criterion:
Patients with any inflammatory diseases requiring chronic anti-inflammatory therapy

Annotated entities:
- Condition: "inflammatory diseases"
- Qualifier: "chronic"
- Procedure: "anti-inflammatory therapy"
- Drug: "anti-inflammatory therapy"